Clinical trial exclusion criterion:
Asthma and allergy to aspirin, ibuprofen or any other nonsteroidal antiinflammatory drug;

Entity relations:
- Has_qualifier("nonsteroidal antiinflammatory drug", "any other")
- AND("allergy", "aspirin")
- OR("aspirin", "nonsteroidal antiinflammatory drug", "ibuprofen")
- OR("Asthma", "allergy")